Which drug is considered as the first line treatment of fibromyalgia?

Pregabalin is, therefore, a valuable option in the first-line treatment of patients with fibromyalgia.